Urinary protein > 1 on dipstick

The above is a clinical trial exclusion criterion. Annotated with entity spans:
[Measurement: Urinary protein] [Value: > 1] on dipstick